副交感神經釋放出 ACh 作用在 muscarinic receptor，會引起平滑肌收縮，主要是下列何種 second messenger 增加？
A. cAMP
B. cGMP
C. IP3
D. PIP2

正確答案：C. IP3